病人車禍瀕臨死亡，他的器官要捐給需要的人，有關器官移植受贈者順位的決定主要依據，下列何者錯誤？
A. 受贈者的疾病嚴重度
B. 受贈者等待移植時間的長短
C. 受贈者接受器官移植的預後
D. 受贈者的社經地位

正確答案：D. 受贈者的社經地位